Clinical trial exclusion criterion:
Known or suspected allergy to octreotide

Entity relations:
- Has_mood("allergy", "Known")
- AND("allergy", "octreotide")
- OR("Known", "suspected")